Clinical trial exclusion criterion:
Uncontrolled serious active infection.

Entity relations:
- Has_qualifier("infection", "Uncontrolled serious")